Clinical trial inclusion criterion:
Those that meet the ACR 1990 and 2010 criteria for Fibromyalgia.

Annotated entities:
- Qualifier: "ACR 1990"
- Qualifier: "ACR 2010"
- Condition: "Fibromyalgia"